Clinical trial inclusion criterion:
Gleason score = 7 (3+4 and/or 4+3) and/or

Annotated entities:
- Measurement: "Gleason score"
- Value: "= 7"
- Value: "3+4"
- Value: "4+3"